Pregnant gestational age >= 28 weeks

The above is a clinical trial inclusion criterion. Annotated with entity spans:
Pregnant [Measurement: gestational age] [Value: >= 28 weeks]